Clinical trial exclusion criterion:
significant history of head trauma/surgery or seizure disorder

Annotated entities:
- Condition: "head trauma"
- Procedure: "head surgery"
- Condition: "seizure disorder"
- Temporal: "history"
- Qualifier: "significant"